Anticipated receipt of any vaccine other than DTaP, IPV, HBV, PCV13, or Hib during the first 60 hours after randomization

The above is a clinical trial exclusion criterion. Annotated with entity spans:
[Mood: Anticipated receipt] of any vaccine other than [Drug: DTaP], [Drug: IPV], [Drug: HBV], [Drug: PCV13], or [Drug: Hib] [Temporal: during the first 60 hours after randomization]